懷孕期攝取過量維生素 A 與下列那種胎兒異常可能有關？
A. 盲眼（blindness）
B. 先天性心臟傳導異常（congenital heart block）
C. 肢體異常（limb malformations）
D. 癲癇（seizures）

正確答案：A. 盲眼（blindness）